Clinical trial inclusion criterion:
4. Years, range 18-60

Entity relations:
- Has_value("Years", "18-60")